Clinical trial inclusion criterion:
Women with PCOS as defined by the Rotterdam criteria.

Annotated entities:
- Condition: "PCOS"
- Person: "Women"
- Measurement: "Rotterdam criteria"